下列何者屬於工具性日常生活量表（instrumental activities of daily living, IADL）的評量項目：
A. 使用電腦
B. 使用電話
C. 閱讀
D. 進食

正確答案：B. 使用電話